關於胸腺瘤的敘述，下列何者錯誤？
A. 前上縱隔腔最常見的縱隔腔腫瘤
B. 第二期的胸腺瘤開刀切除後，常須加上放射治療
C. cisplatin 的化療效果對其治療效果不佳
D. 大部分重肌無力症（myasthenia gravis）無合併胸腺瘤

正確答案：C. cisplatin 的化療效果對其治療效果不佳